Chronic total occlusion (CTO) lesions, in-stent restenosis (ISR)

The above is a clinical trial exclusion criterion. Annotated with entity spans:
[Condition: Chronic total occlusion] ([Condition: CTO]) lesions, [Condition: in-stent restenosis] ([Condition: ISR])